Clinical trial exclusion criterion:
severe atrioventricular block (2nd and 3rd degree)

Annotated entities:
- Qualifier: "severe"
- Condition: "atrioventricular block"
- Qualifier: "2nd degree"
- Qualifier: "3rd degree"